Bleeding site is in, around, or in proximity to foramina in bone, or areas of bony confine.

The above is a clinical trial exclusion criterion. Annotated with entity spans:
[Non-query-able: Bleeding site is in, around, or in proximity to foramina in bone, or areas of bony confine].